Clinical trial exclusion criterion:
Patients who have had a prior abdominal myomectomy

Annotated entities:
- Temporal: "prior"
- Procedure: "abdominal myomectomy"